利用瘧原蟲生活史中那一個時期的抗原做疫苗，雖無預防瘧疾之用但具有治療的功效？
A. 有性生殖期
B. 無性生殖期
C. 孢子小體
D. 任何時期的疫苗都有此功用

正確答案：B. 無性生殖期